下列那些心臟疾病最常聽到收縮期雜音？①心室中隔缺損 ②開放性動脈導管 ③二尖瓣逆流 ④ 主動脈逆流
A. ①③
B. ①④
C. ②③
D. ②④

正確答案：A. ①③